Hepatic Impairment

The above is a clinical trial exclusion criterion. Annotated with entity spans:
[Condition: Hepatic Impairment]